History of allergy or idiosyncratic reaction to diltiazem

The above is a clinical trial exclusion criterion. Annotated with entity spans:
History of [Condition: allergy] or [Condition: idiosyncratic reaction] to [Drug: diltiazem]